T1-3 N0 M0 adenocarcinoma of the prostate

The above is a clinical trial inclusion criterion. Annotated with entity spans:
[Measurement: T][Value: 1-3] [Measurement: N][Value: 0] [Measurement: M][Value: 0] [Condition: adenocarcinoma] of the [Qualifier: prostate]